Which are the uses of deep learning models in Duchenne Muscular Dystrophy?

The results show that each deep learning model endows muscle ultrasound imaging with the ability to enable DMD evaluations.